以生物性製劑（biologicals，如單株抗體等）進行免疫性相關治療所產生之副作用，下列何者錯誤？
A. cytokine release syndrome
B. flu-like symptoms
C. vascular leak syndrome
D. Cushing's syndrome

正確答案：D. Cushing's syndrome